Evidence of intoxication or withdrawal during the screening evaluation

The above is a clinical trial exclusion criterion. Annotated with entity spans:
Evidence of [Condition: intoxication] or [Condition: withdrawal] during the screening evaluation